一位 25 歲男性因為胸悶至門診求診，胸部 X 光顯示縱膈腔有一腫瘤，抽血檢查胎兒蛋白指數 （α-fetoprotein）為 500ng/mL（正常值＜20ng/mL），人類絨毛膜促性腺激素（β-hCG）為
 mIU/mL），這位病人最可能是得了什麼疾病？
A. 淋巴癌
B. 肝癌合併肺轉移
C. 生殖細胞癌
D. 甲狀腺癌

正確答案：C. 生殖細胞癌